Clinical trial exclusion criterion:
American Society of Anesthesiologists score (ASA) III or IV

Annotated entities:
- Measurement: "American Society of Anesthesiologists score (ASA)"
- Value: "III"
- Value: "IV"